Clinical trial exclusion criterion:
Known active cancer receiving treatment

Annotated entities:
- Condition: "cancer"
- Qualifier: "active"
- Procedure: "treatment"